德國麻疹（Rubella）集體免疫力界限水準的維持，主要是使育齡婦女避免感染德國麻疹，因此在下列那一族群實施預防接種德國麻疹疫苗效果最不理想？
A. 青少男
B. 青少女
C. 學齡前男童
D. 學齡前女童

正確答案：A. 青少男